Clinical trial exclusion criterion:
Clinically significant hallucinations for which either 1) the frequency of hallucinations as assessed by the NPI is 'Very frequently', or 2) the frequency of hallucinations as assessed by the NPI is 'Frequently' AND the severity of the hallucinations as assessed by the NPI is 'Moderate', or 'Marked'

Annotated entities:
- Condition: "hallucinations"
- Qualifier: "Clinically significant"
- Multiplier: "frequency of hallucinations"
- Condition: "hallucinations"
- Measurement: "NPI"
- Value: "Very frequently"
- Multiplier: "frequency of hallucinations"
- Condition: "hallucinations"
- Measurement: "NPI"
- Value: "Frequently"
- Qualifier: "severity of the hallucinations"
- Condition: "hallucinations"
- Measurement: "NPI"
- Value: "Moderate"
- Value: "Marked"